Clinical trial exclusion criterion:
Had a serious infection, has been hospitalized for an infection, or has been treated with IV antibiotics for an infection within 2 months prior to Baseline

Entity relations:
- AND("hospitalized", "infection")
- Has_temporal("IV antibiotics", "within 2 months prior to Baseline")
- AND("IV antibiotics", "infection")
- OR("serious infection", "IV antibiotics", "hospitalized")